Pregnant women (women of childbearing potential will be advised to undergo regular pregnancy testing)

The above is a clinical trial exclusion criterion. Annotated with entity spans:
[Pregnancy_considerations: Pregnant women (women of childbearing potential will be advised to undergo regular pregnancy testing)]